Cuando un paciente terminal presenta dolor:
1. La analgesia será pautada.
2. Hay que limitar el tratamiento al uso de fármacos.
3. Se administrarán los fármacos a demanda.
4. La vía de elección para la administración de fármacos será la que determine el facultativo.
5. La vía a utilizar para la administración de analgesia, preferentemente, será la intramuscular.

Respuesta correcta: 1. La analgesia será pautada.